Viral load < 200 copies

The above is a clinical trial inclusion criterion. Annotated with entity spans:
[Measurement: Viral load] [Value: < 200 copies]